Clinical trial inclusion criterion:
Documentation the subject not effectively treated with CPAP therapy. (Examples include non-compliance, discomfort, undesirable side effects, symptoms persist despite use). Subjects who have been prescribed, but refuse to try CPAP would be considered intolerant.

Entity relations:
- Has_negation("CPAP therapy", "not")